Current abnormal blood panel (assessed by comprehensive metabolic panel, lipid panel and complete blood count).

The above is a clinical trial exclusion criterion. Annotated with entity spans:
[Temporal: Current] [Value: abnormal] [Procedure: blood panel] (assessed by comprehensive [Procedure: metabolic panel], [Procedure: lipid panel] and [Procedure: complete blood count]).